Los precipitados coloidales:
1. Dan lugar a suspensiones estables debido a que existen cargas positivas y negativas que interaccionan electrostáticamente.
2. Presentan una elevada superficie, por lo que son capaces de absorber iones en el interior de sus poros.
3. Son convenientes para realizar determinaciones gravimétricas por su elevada pureza y facilidad de filtración.
4. Deben tratarse por calentamiento o adición de un electrolito.

Respuesta correcta: 4. Deben tratarse por calentamiento o adición de un electrolito.